Hyperthyroidism, advanced arteriosclerosis, symptomatic cardiovascular disease, serious structural cardiac abnormalities, cardiomyopathy, serious heart rhythm abnormalities, or a family history of sudden death or death related to heart problems

The above is a clinical trial exclusion criterion. Annotated with entity spans:
[Condition: Hyperthyroidism], [Qualifier: advanced] [Condition: arteriosclerosis], [Qualifier: symptomatic] [Condition: cardiovascular disease], [Qualifier: serious] [Condition: structural cardiac abnormalities], [Condition: cardiomyopathy], [Qualifier: serious] [Condition: heart rhythm abnormalities], or a [Observation: family history] of [Condition: sudden death] or [Condition: death related to heart problems]